Patients with a diagnosis of prostatic carcinoma requiring prostate surgery

The above is a clinical trial inclusion criterion. Annotated with entity spans:
Patients with a diagnosis of [Condition: prostatic carcinoma] requiring [Procedure: prostate surgery]